Clinical trial exclusion criterion:
Women with confirmed or suspected pregnancy

Annotated entities:
- Person: "Women"
- Condition: "pregnancy"
- Qualifier: "confirmed"
- Qualifier: "suspected"